Medications associated with female sexual dysfunction; Antidepressants opiates, beta blockers, Antiepileptics ( gabapentin, topiramate,phenytoin) benzodiazepines

The above is a clinical trial exclusion criterion. Annotated with entity spans:
[Drug: Medications] [Qualifier: associated with female sexual dysfunction]; [Drug: Antidepressants] [Drug: opiates], [Drug: beta blockers], [Drug: Antiepileptics] ( [Drug: gabapentin], [Drug: topiramate],[Drug: phenytoin]) [Drug: benzodiazepines]